Para los seres humanos, los aminoácidos esenciales son:
1. Todos los proteicos.
2. Los no proteicos.
3. Los básicos a pH7.
4. Los que no son sustrato de ninguna transaminasa.
5. Los que no los sintetizan.

Respuesta correcta: 5. Los que no los sintetizan.